histologically proven prostate adenocarcinoma within 1 year of enrollment

The above is a clinical trial inclusion criterion. Annotated with entity spans:
[Qualifier: histologically proven] [Condition: prostate adenocarcinoma] [Temporal: within 1 year of enrollment]